Clinical trial exclusion criterion:
Current pulmonary exacerbation thought to be due to allergic bronchopulmonary aspergillosis (ABPA)

Entity relations:
- Subsumes("allergic bronchopulmonary aspergillosis", "ABPA")
- AND("pulmonary exacerbation", "allergic bronchopulmonary aspergillosis")